下列腫瘤在 advanced stage 時仍有治癒之可能，何者除外？
A. 淋巴癌
B. 生殖細胞瘤
C. 肝癌
D. 神經母細胞瘤（neuroblastoma）

正確答案：C. 肝癌